13. Use of an experimental treatment for PBC

The above is a clinical trial exclusion criterion. Annotated with entity spans:
[Parsing_Error: 13.] Use of an [Procedure: experimental treatment for PBC]